Patients with compromised renal.

The above is a clinical trial exclusion criterion. Annotated with entity spans:
Patients with [Condition: compromised renal].